Clinical trial inclusion criterion:
Orthostatic hypotension after 3-minute standing (systolic blood pressure drop >=20 or diastolic blood pressure drop >=10

Entity relations:
- Has_qualifier("Orthostatic hypotension", "after 3-minute standing")
- Has_value("systolic blood pressure drop", ">=20")
- Has_value("diastolic blood pressure drop", ">=10")
- Subsumes("Orthostatic hypotension", "systolic blood pressure drop")
- OR("systolic blood pressure drop", "diastolic blood pressure drop")